Clinical trial inclusion criterion:
Males and females 21 years of age or older;

Annotated entities:
- Person: "Males"
- Person: "females"
- Person: "age"
- Value: "21 years or older"